Unable to read and understand the Danish language or to give informed consent

The above is a clinical trial exclusion criterion. Annotated with entity spans:
[Observation: Unable to read] and understand the Danish language or to give informed consent